Clinical trial exclusion criterion:
Previous enrolment into the current study

Annotated entities:
- Non-query-able: "Previous enrolment into the current study"